35 歲男性，主訴飽餐後突發性腹痛，直達背部。疼痛持續而嚴重，伴隨嘔吐的症狀。病人吐後無法減輕症狀，但將身體前傾症狀可稍有改善。理學檢查發現病人體溫 38℃，上腹壓痛，腸音降低。 X 光檢查可見十二指腸內氣體增多及左側肋膜腔少量積液。下一步安排何種檢查最適當？
A. 上消化道攝影（upper GI barium study）
B. 消化道內視鏡檢（upper GI endoscopy）
C. HIDA 核醫檢查（HIDA radionuclide scan）
D. 血清澱粉及脂解檢查（serum amylase & lipase）

正確答案：D. 血清澱粉及脂解檢查（serum amylase & lipase）